Clinical trial exclusion criterion:
Any chronic medical illness or condition that contraindicates a surgical procedure under general anesthesia, as judged by the clinical study Investigator

Annotated entities:
- Condition: "contraindicates"
- Procedure: "surgical procedure"
- Procedure: "general anesthesia"